下列有關川崎氏症（Kawasaki disease）的臨床表現敘述，何者最為正確？
A. 即使未治療，通常會高燒3天後退燒
B. 淋巴腺腫大多為雙側且小於0.5mm
C. 眼睛紅，多為單側且有膿樣分泌物
D. 手、腳的脫皮多在症狀開始後2～3星期出現

正確答案：D. 手、腳的脫皮多在症狀開始後2～3星期出現